陳先生預定下個月去西非獅子山國，他上疾病管制局網站，網站建議施打黃熱病疫苗、使用瘧疾預 防性用藥。若你是旅遊門診醫師，最好的處置是下列何者？
A. 只需衛教不需給予任何疫苗或藥物
B. 只需施打黃熱病疫苗
C. 施打黃熱病疫苗及給予瘧疾預防性用藥
D. 衛教避免蚊子叮咬，施打黃熱病疫苗及給予瘧疾預防性用藥

正確答案：D. 衛教避免蚊子叮咬，施打黃熱病疫苗及給予瘧疾預防性用藥